Clinical trial inclusion criterion:
BMI > 18,5 <30 kg/m2

Entity relations:
- Has_value("BMI", "> 18,5 <30 kg/m2")